Clinical trial exclusion criterion:
6. Concurrent use of any testosterone, progestin, androgen, estrogen, anabolic steroids, DHEA or hormonal products for at least 2 weeks prior to screening and during the study.

Entity relations:
- Has_index("for at least 2 weeks prior to screening", "screening")
- Has_temporal("testosterone", "for at least 2 weeks prior to screening")
- Has_temporal("testosterone", "during the study")
- OR("testosterone", "DHEA", "anabolic steroids", "estrogen", "androgen", "progestin", "hormonal products")